Clinical trial inclusion criterion:
singleton pregnancies

Annotated entities:
- Condition: "singleton pregnancies"